Los complejos de cobalto (III):
1. Son todos neutros o aniónicos.
2. Constituyen la base de nuestros conocimientos sobre las propiedades y mecanismos de reacción de los complejos octaédricos.
3. Normalmente son plano-cuadrados.
4. Presentan unas cinéticas de sustitución muy rápidas.
5. Casi todos son preparados sustituyendo unos ligandos por otros.

Respuesta correcta: 2. Constituyen la base de nuestros conocimientos sobre las propiedades y mecanismos de reacción de los complejos octaédricos.